Clinical trial inclusion criteria:
ASA physical status 1-3
elective thoracotomy
can operate patient-controlled analgesia (PCA) machine

Annotated entities:
- Measurement: "ASA physical status"
- Value: "1-3"
- Procedure: "thoracotomy"
- Qualifier: "elective"
- Non-query-able: "can operate patient-controlled analgesia (PCA) machine"